more than tree fingers involvement

The above is a clinical trial exclusion criterion. Annotated with entity spans:
[Multiplier: more than tree] [Condition: fingers involvement]